Clinical trial inclusion criterion:
Manual manoeuvres to facilitate =25% of defecations

Entity relations:
- Has_multiplier("defecations", "=25%")
- AND("Manual manoeuvres", "defecations")